Under other medicine treatment which may affect heart rate, like Non-dihydropyridine calcium channel blockers (NDHP-CCBs) or ivabradine for the last 2 weeks; Under Digoxin treatment [more than (>) 0.125 milligram (mg)].

The above is a clinical trial exclusion criterion. Annotated with entity spans:
[Non-query-able: Under other medicine treatment which may affect heart rate], like [Drug: Non-dihydropyridine calcium channel blockers] ([Drug: NDHP-CCBs]) or [Drug: ivabradine] [Temporal: for the last 2 weeks]; Under [Drug: Digoxin] treatment [[Multiplier: more than] ([Value: >]) 0.125 milligram (mg)].